at modified Hoehn and Yahr (H&Y) stage 1.5 to 3 (Hoehn and Yahr ,1967; Goetz et al., 2004);

The above is a clinical trial inclusion criterion. Annotated with entity spans:
at [Measurement: modified Hoehn and Yahr (H&Y)] [Value: stage 1.5 to 3] (Hoehn and Yahr ,1967; Goetz et al., 2004);